En electrolisis a potencial controlado:
1. Se utiliza un montaje de dos electrodos y la corriente pasa entre el electrodo de trabajo y el de referencia.
2. Se utiliza un montaje de dos electrodos y no pasa corriente entre el electrodo de trabajo y el de referencia.
3. Se utiliza un montaje de tres electrodos y la corriente pasa entre el electrodo de trabajo y el de referencia.
4. Se utiliza un montaje de tres electrodos y la corriente pasa entre el electrodo de trabajo y el auxiliar.

Respuesta correcta: 4. Se utiliza un montaje de tres electrodos y la corriente pasa entre el electrodo de trabajo y el auxiliar.